Clinical trial exclusion criterion:
Evidence of current severe major depressive disorder or suicidal ideation

Entity relations:
- Has_qualifier("major depressive disorder", "severe")
- OR("major depressive disorder", "suicidal ideation")